相較於引發產生抗體的初次反應（primary response），同一個蛋白質抗原所引起的二次反應（secondary response）的特性為何？
A. 通常需要較長的時間才能開始有大量的抗體生成
B. 有記憶性淋巴細胞的參與
C. 主要是製造並分泌大量 IgM
D. 所產生的抗體力價（titer）與初次反應相當

正確答案：B. 有記憶性淋巴細胞的參與